下列何種動作與背部中間層的肌肉群有關？
A. 與呼吸相關之運動
B. 彎屈上臂之動作
C. 伸展上臂之動作
D. J 彎曲脊柱之動作

正確答案：A. 與呼吸相關之運動